Clinical trial exclusion criteria:
Any MS relapse in the last five years, as determined at the screen visit by the PI
Any new or definitely enlarging T2/FLAIR lesion or new gadolinium-enhancing lesion within the past three years (at least two scans separated by at least three years must be reviewed) on brain or spine MRI scan. Lesions must be 3mm or larger to be exclusionary.
Significant (as defined by the PI) intolerance of presently-used DMT
Use of inhaled or topical steroids are not an exclusion criteria.
Use of oral steroids for no greater than 14 days given for a non-MS condition is not exclusionary.
alemtuzumab,
mitoxantrone,
cyclophosphamide,
methotrexate,
cyclosporine, or
rituximab
Prior use of any experimental agent used as a DMT for MS in the last five years
uncontrolled hypertension,
uncontrolled diabetes,
uncontrolled asthma, or
uncontrolled depression
Cancers other than basal cell skin cancers within the last 5 years
Unable to give informed consent or follow the protocol
Unable to undergo brain MRI
Unwilling to be randomized per this protocol
History of other chronic neurological illnesses that might mimic MS with chronic or intermittent symptoms (i.e. ALS, myasthenia gravis, chronic neuropathy, etc.)

Annotated entities:
- Condition: "MS"
- Condition: "relapse"
- Temporal: "in the last five years"
- Condition: "T2/FLAIR lesion"
- Drug: "gadolinium"
- Qualifier: "gadolinium-enhancing"
- Condition: "lesion"
- Temporal: "within the past three years"
- Multiplier: "at least two"
- Procedure: "scans"
- Temporal: "separated by at least three years"
- Procedure: "spine MRI scan"
- Procedure: "brain MRI scan"
- Qualifier: "3mm or larger"
- Condition: "Lesions"
- Qualifier: "Significant"
- Condition: "intolerance"
- Temporal: "presently-used"
- Drug: "DMT"
- Drug: "inhaled steroids"
- Drug: "topical steroids"
- Negation: "not"
- Non-representable: "Use of inhaled or topical steroids are not an exclusion criteria."
- Drug: "oral steroids"
- Temporal: "no greater than 14 days"
- Condition: "non-MS condition"
- Negation: "not"
- Non-representable: "Use of oral steroids for no greater than 14 days given for a non-MS condition is not exclusionary."
- Drug: "alemtuzumab"
- Drug: "mitoxantrone"
- Drug: "cyclophosphamide"
- Drug: "methotrexate"
- Drug: "cyclosporine"
- Drug: "rituximab"
- Non-query-able: "Prior use of any experimental agent used as a DMT for MS in the last five years"
- Condition: "hypertension"
- Qualifier: "uncontrolled"
- Condition: "diabetes"
- Qualifier: "uncontrolled"
- Condition: "asthma"
- Qualifier: "uncontrolled"
- Condition: "depression"
- Qualifier: "uncontrolled"
- Condition: "Cancers"
- Negation: "other than"
- Condition: "basal cell skin cancers"
- Temporal: "within the last 5 years"
- Non-query-able: "Unable to give informed consent or follow the protocol"
- Procedure: "brain MRI"
- Mood: "Unable to undergo"
- Post-eligibility: "Unwilling to be randomized per this protocol"
- Condition: "chronic neurological illnesses"
- Temporal: "History of"
- Qualifier: "mimic MS"
- Condition: "ALS"
- Condition: "myasthenia gravis"
- Condition: "chronic neuropathy"